有關細胞膜上之脂膜筏（lipid raft），下列敘述何者正確？
A. 有較低量膽固醇（cholesterol）
B. 有較低量鞘脂（sphingolipid）
C. 不含有燒杯狀膜小囊蛋白（caveolin）
D. 有較高量的糖基化磷脂醯肌醇（glycosylated derivative of phosphatidylinositol; GPI）結合蛋白質

正確答案：D. 有較高量的糖基化磷脂醯肌醇（glycosylated derivative of phosphatidylinositol; GPI）結合蛋白質